Renal, hepatic, gastrointestinal, or biliary disorder that could impair absorption, metabolism or excretion of orally administered medication

The above is a clinical trial exclusion criterion. Annotated with entity spans:
[Qualifier: Renal], [Qualifier: hepatic], [Qualifier: gastrointestinal], or [Qualifier: biliary] [Condition: disorder] that could [Condition: impair absorption], metabolism or excretion of [Drug: orally administered medication]